下列何者為形成蛋白質二級結構（如α-螺旋）的最主要原因？
A. 疏水性（hydrophobic）交互作用
B. 靜電作用
C. 分子內氫鍵（hydrogen bond）
D. 兩條α-螺旋鏈之間的雙硫鍵（disulfide bond）

正確答案：C. 分子內氫鍵（hydrogen bond）